治療鐮刀型貧血（sickle cell anemia）可使用下列何種藥物？
A. Folate
B. Deferoxamine
C. Hydroxyurea
D. Pyridoxine

正確答案：C. Hydroxyurea